No positive HIV 1 or HIV 2 test at screening

The above is a clinical trial exclusion criterion. Annotated with entity spans:
No [Value: positive] [Measurement: HIV 1] or [Measurement: HIV 2 test] [Temporal: at screening]